Clinical trial exclusion criterion:
Known diagnosis of moderate or malignant retinopathy (including retinal hemorrhage, visual disturbance and retinal microaneurysm within 6 months)

Annotated entities:
- Qualifier: "malignant"
- Qualifier: "moderate"
- Condition: "retinopathy"
- Condition: "retinal hemorrhage"
- Condition: "visual disturbance"
- Condition: "retinal microaneurysm"
- Temporal: "within 6 months"